7. Subject and/or Primary Caregiver must be competent to follow all study procedures.

The above is a clinical trial inclusion criterion. Annotated with entity spans:
[Parsing_Error: 7.] [Post-eligibility: Subject and/or Primary Caregiver must be competent to follow all study procedures.]